有關高脂血症之敘述，下列何者最不適當？
A. 血中三酸甘油酯濃度偏高，與心臟病無關
B. 血中三酸甘油酯濃度偏高，治療的首選藥物是纖維酸衍生物（fibric acid derivatives）
C. 血中低密度脂蛋白膽固醇（LDL-C）濃度偏高，與心臟病有關
D. 治療高膽固醇血症，首選的藥物是使達錠（statin）

正確答案：A. 血中三酸甘油酯濃度偏高，與心臟病無關